Clinical trial exclusion criterion:
Life expectancy less than 2 years

Annotated entities:
- Observation: "Life expectancy"
- Value: "less than 2 years"